Clinical trial exclusion criterion:
a known allergy to dexmedetomidine hydrochloride

Annotated entities:
- Condition: "allergy"
- Drug: "dexmedetomidine hydrochloride"